Clinical trial inclusion criterion:
History of blast and/or impact head trauma mTBI meeting Defense and Veterans Brain Injury Center (DVBIC) mTBI criteria, which define mTBI as an injury to the head causing at least one of the following: alteration in consciousness (for up to 24 hours after the injury), loss of consciousness 0-30 minutes, and/or post-traumatic amnesia up to 1 day post-injury. If available, the Glasgow Coma Scale score must be 13-15, and head imaging findings (if imaging was performed) must be negative.

Annotated entities:
- Observation: "blast"
- Temporal: "History of"
- Condition: "impact head trauma"
- Measurement: "Defense and Veterans Brain Injury Center (DVBIC) mTBI criteria"
- Value: "meeting"
- Condition: "alteration in consciousness"
- Temporal: "for up to 24 hours after the injury"
- Reference_point: "the injury"
- Condition: "loss of consciousness"
- Temporal: "0-30 minutes"
- Condition: "post-traumatic amnesia"
- Temporal: "up to 1 day post-injury"
- Measurement: "Glasgow Coma Scale"
- Value: "13-15"
- Procedure: "head imaging"
- Condition: "findings"
- Negation: "negative"